Clinical trial exclusion criterion:
Acute liver failure

Annotated entities:
- Condition: "Acute liver failure"